異位性皮膚炎患者，皮膚除了濕疹，還常合併下列何種表現？
A. ichthyosis
B. seborrhea
C. dermatophytosis
D. psoriasis

正確答案：A. ichthyosis